Computational tools for predicting allosteric pathways in proteins

Computational tools for predicting allosteric pathways in proteins include MCPath, MutInf, pySCA, CorrSite, and CARDS.